¿Qué músculo tiene uno de su orígenes (inserción proximal) en la apófisis coracoides de la escápula?:
1. El tríceps branquial.
2. El deltoides.
3. El trapecio.
4. El supraespinoso.
5. El bíceps braquial.

Respuesta correcta: 5. El bíceps braquial.